Clinical trial exclusion criterion:
Psychiatric illness

Annotated entities:
- Condition: "Psychiatric illness"